Patient treated with drugs supposed to alter gastric emptying times (calcium antagonists, Alimentary tract treatments, opioid analgesics, tricyclic antidepressants, antibiotics).

The above is a clinical trial exclusion criterion. Annotated with entity spans:
Patient treated with [Drug: drugs supposed to alter gastric emptying times] ([Drug: calcium antagonists], [Procedure: Alimentary tract treatments], [Drug: opioid analgesics], [Drug: tricyclic antidepressants], [Drug: antibiotics]).